Older than the age of legal consent (i.e. 18 years old)

The above is a clinical trial inclusion criterion. Annotated with entity spans:
[Value: Older than the age of legal consent] (i.e. [Value: 18 years old])